下列何種肺膨脹不全（atelectasis）通常為不可逆之變化？
A. 吸收性肺膨脹不全（resorption atelectasis）
B. 阻塞性肺膨脹不全（obstruction atelectasis）
C. 壓迫性肺膨脹不全（compression atelectasis）
D. 收縮性肺膨脹不全（contraction atelectasis）

正確答案：D. 收縮性肺膨脹不全（contraction atelectasis）